Clinical trial inclusion criterion:
8. Adequate renal function as follows (10% deviation allowed)

Annotated entities:
- Parsing_Error: "8."
- Measurement: "renal function"
- Value: "Adequate"
- Parsing_Error: "Adequate renal function as follows (10% deviation allowed)"